Clinical trial inclusion criterion:
2. Pancreas cancer, either s/p resection and adjuvant chemotherapy or locally advanced pancreas cancer s/p chemotherapy and radiation. Initial chemotherapy or radiation therapy may have been stopped between 2 weeks and 2 months prior to study start, and patients must have recovered from prior treatment related toxicity to grade 1 or less.

Annotated entities:
- Condition: "Pancreas cancer"
- Condition: "s/p resection"
- Procedure: "resection"
- Condition: "s/p adjuvant chemotherapy"
- Procedure: "adjuvant chemotherapy"
- Condition: "pancreas cancer"
- Qualifier: "locally advanced"
- Condition: "s/p chemotherapy"
- Procedure: "chemotherapy"
- Condition: "s/p radiation"
- Procedure: "radiation"
- Procedure: "chemotherapy"
- Procedure: "radiation therapy"
- Temporal: "between 2 weeks and 2 months prior to study start"
- Reference_point: "study start"
- Condition: "recovered from prior treatment"
- Procedure: "treatment"
- Temporal: "prior"
- Observation: "may have been stopped"